抗體分子中的互補決定區域（complementarity-determining regions）可以：
A. 活化補體（complement activation）
B. 與抗原結合
C. 決定抗體的亞型（subclasses）
D. 決定抗體的異型（allotypes）

正確答案：B. 與抗原結合